下列何者非手術時置放中央靜脈導管之目的？
A. 手術時給予輸液
B. 監測右心房壓力
C. 抽出空氣栓塞（air embolism）
D. 測量左心室末期舒張壓

正確答案：D. 測量左心室末期舒張壓